當一位 26 歲女性出現兩側的核間眼神經麻痺時（bilateral internuclear ophthalmoplegia），最可能的診斷是：
A. 多發性硬化症
B. 腦幹的缺血性中風
C. 腦幹的動靜脈畸型
D. 腦幹腫瘤

正確答案：A. 多發性硬化症